一位 30 歲女性病人，無吸菸習慣，有長期咳嗽咳痰症狀。此次因發燒、左胸痛、咳痰求診，胸部 X 光與電腦斷層掃描發現左肺下葉內側有一腫塊，內含囊性變化（cystic change），進一步何種檢查對診斷最有助益？
A. 痰細胞檢查
B. 支氣管鏡檢查
C. 正子掃描檢查（PET）
D. 核磁共振血管檢查（MRA）

正確答案：D. 核磁共振血管檢查（MRA）